Patients must complain of mild to moderate arthralgia.

The above is a clinical trial inclusion criterion. Annotated with entity spans:
Patients must complain of [Qualifier: mild] to [Qualifier: moderate] [Condition: arthralgia].